Clinical trial exclusion criterion:
Hormones (for example, testosterone, estrogen, or progesterone) in any form.

Annotated entities:
- Non-representable: "Hormones (for example, testosterone, estrogen, or progesterone) in any form."